Si un paciente tiene pautado codeína en su tratamiento para el dolor, ¿en qué escalón de la escalera de la OMS (Organización Mundial de la Salud) se encuentra?:
1. Primer escalón.
2. Segundo escalón.
3. Tercer escalón.
4. Cuarto escalón.

Respuesta correcta: 2. Segundo escalón.